慢性糖尿病病人，在尿路動力學檢查（urodynamic study），最不會出現下列那一結果？
A. 膀胱感覺變差
B. 慢性膀胱過脹（overdistension）
C. 逼尿肌過度反射（detrusor hyperreflexia）
D. 餘尿（postvoiding residuals）增加

正確答案：C. 逼尿肌過度反射（detrusor hyperreflexia）